媽媽抱 1個月的嬰兒前來就診，男嬰的右耳耳廓發育不良比正常小很多，且無外耳道。左耳外觀及耳膜均正常，這時接下來的處置，何者最適當？
A. 耳部高解析度電腦斷層檢查
B. 耳道及外耳整型手術
C. 選配骨導式助聽器
D. 聽性腦幹誘發電位檢查評估聽力

正確答案：D. 聽性腦幹誘發電位檢查評估聽力